Severe coagulation disorder: prothrombin time <40% (or INR >1.7) or platelet count <30,000/mm3

The above is a clinical trial exclusion criterion. Annotated with entity spans:
[Qualifier: Severe] [Condition: coagulation disorder]: [Measurement: prothrombin time] [Value: <40%] (or [Measurement: INR] [Value: >1.7]) or [Measurement: platelet count] [Value: <30,000/mm3]